Clinical trial exclusion criterion:
body mass index > 35

Entity relations:
- Has_value("body mass index", "> 35")